Clinical trial exclusion criterion:
Additional congenital gastrointestinal abnormalities requiring surgical intervention

Annotated entities:
- Condition: "gastrointestinal abnormalities"
- Qualifier: "Additional"
- Procedure: "surgical intervention"
- Mood: "requiring"
- Qualifier: "congenital"